顆粒性包生絛蟲（Echinococcus granulosus）在人體感染最常侵犯那個器官？
A. 小腸
B. 肝臟
C. 心臟
D. 腦

正確答案：B. 肝臟